moribund patients,

The above is a clinical trial exclusion criterion. Annotated with entity spans:
[Condition: moribund] patients,